Clinical trial inclusion criterion:
Men between 45 and 80 years age

Entity relations:
- Has_value("age", "between 45 and 80 years")